Clinical trial inclusion criterion:
patients receiving home parenteral nutrition (HPN) because of short bowel syndrome for at least 12 months

Annotated entities:
- Measurement: "home parenteral nutrition (HPN)"
- Condition: "short bowel syndrome"
- Temporal: "for at least 12 months"